Patients who have undergone a previous solid organ transplant (including kidney transplant) or who are going to receive another solid organ transplant concomitantly.

The above is a clinical trial exclusion criterion. Annotated with entity spans:
Patients who have undergone a [Temporal: previous] [Procedure: solid organ transplant] (including [Procedure: kidney transplant]) or who are going to receive [Qualifier: another] [Procedure: solid organ transplant] [Temporal: concomitantly].